¿En qué cuatro áreas problemáticas se centra la terapia interpersonal para la depresión?
1. Las disputas interpersonales, las relaciones sexuales, los déficits interpersonales y las relaciones madre-hijo durante la infancia.
2. Los déficits interpersonales, las relaciones madre-hijo durante la infancia, las relaciones sexuales y la transición de rol.
3. El duelo, las disputas interpersonales, la transición de rol y los déficits interpersonales.
4. Las relaciones sexuales, las relaciones madrehijo durante la infancia, los problemas de pareja y los problemas familiares actuales.
5. El duelo, las relaciones madre-hijo durante la infancia, las disputas interpersonales y las relaciones sexuales.

Respuesta correcta: 3. El duelo, las disputas interpersonales, la transición de rol y los déficits interpersonales.